Hypertrophic or restrictive cardiomyopathy.

The above is a clinical trial exclusion criterion. Annotated with entity spans:
[Condition: Hypertrophic] or [Condition: restrictive cardiomyopathy].